Clinical trial inclusion criterion:
Both sexes

Annotated entities:
- Person: "Both sexes"